Clinical trial exclusion criterion:
Insufficient response to pregabalin in the treatment of partial seizure, or patients currently receiving pregabalin treatment.

Annotated entities:
- Drug: "pregabalin"
- Condition: "partial seizure"
- Drug: "pregabalin"
- Observation: "Insufficient response"